關於抗帕金森病藥物（antiparkinson's drug）的敘述，下列何者正確？
A. carbidopa是dopamine的前驅藥物
B. rasagiline是B型單胺氧化酶（monoamine oxidase B）的抑制劑
C. pramipexole抑制dopamine受體
D. benztropine促進神經末梢dopamine的釋放

正確答案：B. rasagiline是B型單胺氧化酶（monoamine oxidase B）的抑制劑